Clinical trial inclusion criterion:
ACT score <20 at randomization visit (visit 2).

Entity relations:
- Has_value("ACT score", "<20")
- Has_temporal("ACT score", "at randomization visit")